When is the protein OAS1 activated?

OAS1 is a IFN-stimulated gene. Antiviral response.